Clinical trial exclusion criterion:
Underlying comorbidities that contraindicate the procedure (including but not limited to polycythemia, coagulation disorder, or malignancy).

Annotated entities:
- Condition: "Underlying comorbidities"
- Qualifier: "contraindicate the procedure"
- Condition: "contraindicate"
- Procedure: "procedure"
- Condition: "polycythemia"
- Condition: "coagulation disorder"
- Condition: "malignancy"